Clinical trial inclusion criterion:
Meet at least one other criterion of the Rome-IV criteria for idiopathic constipation based on the 3-week defecation diary (1)

Entity relations:
- AND("criterion", "Rome-IV criteria for idiopathic constipation")
- Has_qualifier("criterion", "other")
- Has_multiplier("criterion", "at least one")
- AND("Rome-IV criteria for idiopathic constipation", "3-week defecation diary")
- multi("Rome-IV criteria for idiopathic constipation", "idiopathic constipation")